Men or women aged 18 years or older

The above is a clinical trial inclusion criterion. Annotated with entity spans:
[Person: Men] or [Person: women] [Person: aged] [Value: 18 years or older]